下列何染色體具有人類睪丸決定因子（testis-determining factor）？
A. 第5對
B. 第21對
C. X
D. Y

正確答案：D. Y